Clinical trial inclusion criterion:
=1 doses of ticagrelor or prasugrel within 5 days before randomisation

Entity relations:
- Has_index("within 5 days before randomisation", "randomisation")
- Has_multiplier("ticagrelor", "=1 doses")
- OR("ticagrelor", "prasugrel")